下列有關「妥瑞氏症候群」（Tourette's syndrome）之敘述，何者錯誤？
A. 通常一開始是簡單的動作抽搐
B. 發聲抽搐往往比動作抽搐早出現
C. 抽搐症狀起伏，即使用藥也可拖上數期
D. 大多數個案在進入成年期，症狀趨於平緩

正確答案：B. 發聲抽搐往往比動作抽搐早出現